Clinical trial exclusion criterion:
6. Grade 2 or higher peripheral ischemia, except for brief (< 24 hrs) episodes of ischemia managed non-surgically and without permanent deficit.

Entity relations:
- Has_value("Grade 2 or higher", "2 or higher")
- Has_qualifier("peripheral ischemia", "Grade 2 or higher")
- Subsumes("brief", "< 24 hrs")
- Has_negation("surgically", "non")
- AND("ischemia", "surgically")
- Has_negation("permanent deficit", "without")
- AND("ischemia", "permanent deficit")
- Has_temporal("ischemia", "brief")
- Has_negation("ischemia", "except")
- AND("peripheral ischemia", "ischemia")